Mujer de 63 años que acude al servicio de Urgencias refiriendo cefalea intensa con signos de irritación meníngea, alteraciones visuales bilaterales y oftalmoplejía. Se realiza una TAC que muestra lesión ocupante de espacio en silla turca de 2 cm compatible con adenoma hipofisario con signos de hemorragia intratumoral, con desviación del tallo hipofisario y compresión del tejido glandular. Señale cuál de las siguientes respuestas es INCORRECTA:
1. La sospecha diagnóstica es una apoplejía hipofisaria.
2. Se debería iniciar tratamiento con corticoides a dosis altas y observar la evolución, puesto que este tratamiento podría reducir el volumen de la lesión y evitar la intervención.
3. Debe plantearse el tratamiento con glucocorticoides para evitar una insuficiencia adrenal secundaria que comprometa el pronóstico vital de la paciente.
4. La presencia de oftalmoplejía y los defectos visuales constituyen indicaciones para intervenir sin demora mediante descompresión quirúrgica urgente.
5. Tras la resolución del cuadro agudo, es frecuente el desarrollo de panhipopituitarismo.

Respuesta correcta: 2. Se debería iniciar tratamiento con corticoides a dosis altas y observar la evolución, puesto que este tratamiento podría reducir el volumen de la lesión y evitar la intervención.